Clinical trial exclusion criterion:
Concurrent diagnosis of chronic obstructive pulmonary disease (COPD) or other respiratory disorders including active tuberculosis, lung cancer, bronchiectasis, sarcoidosis, lung fibrosis, pulmonary hypertension, interstitial lung diseases or other active pulmonary diseases.

Entity relations:
- Has_qualifier("pulmonary diseases", "active")
- Has_qualifier("pulmonary diseases", "other")
- Has_qualifier("tuberculosis", "active")
- Has_qualifier("respiratory disorders", "other")
- Subsumes("chronic obstructive pulmonary disease (COPD)", "tuberculosis")
- OR("bronchiectasis", "pulmonary diseases", "pulmonary hypertension", "lung fibrosis", "sarcoidosis", "interstitial lung diseases")
- OR("chronic obstructive pulmonary disease (COPD)", "respiratory disorders")